Is dialysis-dependent or has (or is suspected of having) severe renal insufficiency (defined as estimated glomerular filtration rate (eGFR) <30 ml/min).

The above is a clinical trial exclusion criterion. Annotated with entity spans:
Is [Condition: dialysis-dependent] or has (or is suspected of having) [Condition: severe renal insufficiency] (defined as [Measurement: estimated glomerular filtration rate (eGFR)] [Value: <30 ml/min]).